11. History of portal hypertension or chronic liver disease, including positive serology for infection with HCV and/or HBV.

The above is a clinical trial exclusion criterion. Annotated with entity spans:
[Parsing_Error: 11.] History of [Condition: portal hypertension] or [Condition: chronic liver disease], including [Value: positive] [Measurement: serology for infection with HCV] and/or HBV.